Clinical trial exclusion criterion:
Pregnant or lactating female and female of childbearing potential.

Entity relations:
- OR("Pregnant", "lactating", "childbearing potential")